currently use ventilator

The above is a clinical trial exclusion criterion. Annotated with entity spans:
[Temporal: currently] use [Procedure: ventilator]